Spitzer y colaboradores desarrollaron en 1994 un cuestionario y una entrevista conjunta para la evaluación de los principales trastornos más frecuentes en los servicios de salud de Atención Primaria. Este instrumento se denomina :
1. DIS-CIDI.
2. SCID II.
3. PRIME-MD.
4. ADIS.
5. SADS.

Respuesta correcta: 3. PRIME-MD.